Clinical trial exclusion criterion:
Use of smoking cessation medications or interventions in last 30 days

Annotated entities:
- Procedure: "smoking cessation"
- Procedure: "medications"
- Procedure: "interventions"
- Temporal: "in last 30 days"